Clinical trial exclusion criterion:
Ongoing use of other psoriasis treatment including but not limited to topical or systemic corticosteroids, other topical medications (i.e. coal tar), oral or biologic medications for the treatment of psoriasis, and UV therapy. The following washout periods will be required: 2 weeks for topical therapy; 2 weeks for phototherapy; 12 weeks for biologic or targeted therapies; 4 weeks for other systemic therapies

Annotated entities:
- Procedure: "treatment"
- Condition: "psoriasis"
- Drug: "topical corticosteroids"
- Drug: "systemic corticosteroids"
- Drug: "topical medications"
- Drug: "coal tar"
- Drug: "oral medications"
- Drug: "biologic medications"
- Procedure: "UV therapy"
- Non-representable: "The following washout periods will be required: 2 weeks for topical therapy; 2 weeks for phototherapy; 12 weeks for biologic or targeted therapies; 4 weeks for other systemic therapies"
- Temporal: "Ongoing"